Age: ≥ 18 years

The above is a clinical trial inclusion criterion. Annotated with entity spans:
[Person: Age]: [Value: ≥ 18 years]